Clinical trial inclusion criterion:
Adult patients scheduled for arthroscopic knee ligament reconstruction

Entity relations:
- Has_mood("arthroscopic knee ligament reconstruction", "scheduled")